Can achieve best corrected spectacle distance visual acuity of 20/25 (0.10 logMAR) or better in each eye.

The above is a clinical trial inclusion criterion. Annotated with entity spans:
Can achieve [Measurement: best corrected spectacle distance visual acuity] of [Value: 20/25] ([Value: 0.10 logMAR]) or better in each eye.